下列心臟構造，何者由冠狀動脈供應血流？
A. 心內膜（endocardium）
B. 心包膜外層（parietal layer of pericardium）
C. 心外膜（epicardium）
D. 心瓣膜

正確答案：C. 心外膜（epicardium）